A la mayor tasa de recuerdo de los primeros ítems de una lista se le denomina:
1. Efecto de primacía.
2. Efecto de recencia.
3. Efecto sufijo.
4. Efecto Von Restorff.
5. Interferencia proactiva.

Respuesta correcta: 1. Efecto de primacía.